氣喘病是一慢性疾病，也認為與 Th2 細胞所分泌的細胞素（cytokines）有關，下列敘述何者錯誤？
A. IL-4 會讓氣管黏液（mucus）分泌增加
B. IL-4 也可以刺激纖維母細胞（fibroblast）生長
C. IL-5 會增加表皮細胞下纖維增生（subepithelial fibrosis）
D. Interferon γ會使細胞重模組化（remodeling）

正確答案：D. Interferon γ會使細胞重模組化（remodeling）